Clinical trial inclusion criterion:
Serum erythropoietin <500 milliunits/milliliter (mU/mL) within 14 days prior to the first dose of study treatment

Entity relations:
- Has_value("Serum erythropoietin", "<500 milliunits/milliliter")
- Has_temporal("Serum erythropoietin", "within 14 days prior to the first dose of study treatment")